Minimum 1 cm,

The above is a clinical trial inclusion criterion. Annotated with entity spans:
[Non-representable: Minimum 1 cm,]